Clinical trial inclusion criterion:
routinely referred for small bowel video capsule endoscopy (CE)

Entity relations:
- Has_multiplier("small bowel video capsule endoscopy", "routinely referred")